Clinical trial inclusion criterion:
PDR patients requiring surgical intervention for complications of vitreous hemorrhage or traction retinal detachment and pre-operative IVC treatment.

Entity relations:
- Has_mood("surgical intervention", "requiring")
- Has_qualifier("IVC treatment", "pre-operative")
- AND("surgical intervention", "vitreous hemorrhage")
- OR("vitreous hemorrhage", "traction retinal detachment", "IVC treatment")